Willing to provide multiple blood specimens collected by venipuncture

The above is a clinical trial inclusion criterion. Annotated with entity spans:
[Non-query-able: Willing to provide multiple blood specimens collected by venipuncture]